Clinical trial exclusion criterion:
Systemic infection

Annotated entities:
- Condition: "Systemic infection"